有關預防嬰幼兒過敏的觀念，下列敘述何者最不恰當？
A. 建議孕婦飲食不需避免高過敏食物（例如海鮮、花生等）
B. 建議在4～6個月大開始添加副食品
C. 尚未有國際指引建議嬰幼兒常規性使用益生菌來預防過敏
D. 母乳餵哺期間，母親需要避免食用高過敏食物

正確答案：D. 母乳餵哺期間，母親需要避免食用高過敏食物